肝穿刺是診斷肝臟纖維化的黃金標準，但有其臨床應用的困難與判讀上的限制。非侵入性肝纖維化檢測是可 行的替代方案，而且目前臨床上已經逐漸廣為採用。下列有關各種非侵入性肝纖維化檢測方法的描述，何者
 錯誤？
A. 兩大檢測主流包括利用血清生物學標誌檢測以及利用儀器檢測肝臟的硬度
B. 血清生物學標誌檢測（如FibroTest）對於各種原因引起的肝臟疾病都可以精準判定各等級肝纖維化程度
C. transient elastography（如FibroScan）可以快速簡單的檢測肝臟硬度，但對於過度肥胖與有腹水之患者測定能力會降低
D. magnetic resonance elastography（MRE）判定各等級肝纖維化程度的能力比transient elastography好

正確答案：B. 血清生物學標誌檢測（如FibroTest）對於各種原因引起的肝臟疾病都可以精準判定各等級肝纖維化程度